下列有關急性主動脈剝離（aortic dissection）之描述，何者正確？
A. 急性主動脈剝離最佳診斷工具是心臟超音波（cardiac echocardiography）或是核磁共振攝影（magnetic
B. 急性主動脈剝離發生的機制大都是內膜層有一個破口（intimal tear），通常是在主動脈壁外層
C. 發生急性主動脈剝離最常見的症狀為胸痛，非常類似冠狀動脈疾病的壓迫性胸痛，二者並不容易區別
D. 發生急性主動脈剝離的病人，大多都以胸痛為主要症狀，並不會引起其他器官的血流不足（malperfusion）

正確答案：B. 急性主動脈剝離發生的機制大都是內膜層有一個破口（intimal tear），通常是在主動脈壁外層